蹠肌（plantaris）的肌腱位於下列那兩塊肌肉之間？
A. 腓腸肌（gastrocnemius）與比目魚肌（soleus）
B. 比目魚肌與脛後肌（tibialis posterior）
C. 脛後肌與脛前肌（tibialis anterior）
D. 腓骨長肌（fibularis longus）與腓骨短肌（fibularis brevis）

正確答案：A. 腓腸肌（gastrocnemius）與比目魚肌（soleus）